在糖解（glycolysis）作用中，那個酵素的功能可將六碳糖分解為兩個三碳糖？
A. phosphohexose isomerase
B. aldolase
C. triose phosphate isomerase
D. enolase

正確答案：B. aldolase